Thyrotoxicosis

The above is a clinical trial exclusion criterion. Annotated with entity spans:
[Condition: Thyrotoxicosis]